Clinical trial inclusion criteria:
over 18 years
successful angioplasty (residual stenosis < 30%) on a significant stenosis (maximal systolic speed 3 times > from basal maximal systolic speed, stenosis > 70% on angiography) on the venous-prosthesis anastomosis or on the venous segment 5 cm after the anastomosis of a prosthetic haemodialysis vascular access (at least 1 month old)
social security affiliation
signed informed consent

Annotated entities:
- Value: "over 18 years"
- Person: "over 18 years"
- Procedure: "on the venous-prosthesis anastomosis angioplasty"
- Qualifier: "successful"
- Measurement: "residual stenosis"
- Value: "< 30%"
- Condition: "stenosis"
- Qualifier: "significant"
- Measurement: "maximal systolic speed"
- Value: "3 times > from basal"
- Measurement: "stenosis"
- Value: "> 70%"
- Procedure: "angiography"
- Procedure: "on the venous segment 5 cm after the anastomosis angioplasty"
- Observation: "social security affiliation"
- Observation: "signed informed consent"